一個 7 週大的嬰兒之血色素為 9.5 g/dL，該嬰兒餵哺母奶，此外無其他健康問題，且其為足月兒，無併發症，就其血色素值及身體狀況，此嬰兒最可能有以下那一種狀況？
A. 缺鐵性貧血（iron deficiency anemia）
B. 先天性血色素病變（congenital hemoglobinopathy）
C. 鉛中毒（lead poisoning）
D. 生理性貧血（physiologic anemia）

正確答案：D. 生理性貧血（physiologic anemia）